中樞神經系統中，偵測體液滲透壓，並參與調節抗利尿激素（anti-diuretic hormone）分泌的滲透壓性受器（osmoreceptor）之分布最接近下列何處？
A. 視上核（supraoptic nucleus）
B. 錐體皮質（pyramidal cortex）
C. 錐體交叉（pyramidal decussation）
D. 內側蹄狀系統（medial lemniscus system）

正確答案：A. 視上核（supraoptic nucleus）